¿Cuál de los antibióticos reseñados es ototóxico?:
1. Bencilpenicilina.
2. Ceftazidima.
3. Estreptomicina.
4. Imipenem.

Respuesta correcta: 3. Estreptomicina.